In addition to the subjects, prohibitting other people taking this product.

The above is a clinical trial inclusion criterion. Annotated with entity spans:
[Undefined_semantics: In addition to the subjects, prohibitting other people taking this product].